Pregnant (or anticipate pregnancy during the study period) or lactating women

The above is a clinical trial exclusion criterion. Annotated with entity spans:
[Condition: Pregnant] (or [Mood: anticipate] [Condition: pregnancy] during the study period) or [Condition: lactating] [Person: women]